Clinical trial exclusion criterion:
Allergy or hypersensitivity to bupivacaine

Annotated entities:
- Condition: "Allergy"
- Condition: "hypersensitivity"
- Drug: "bupivacaine"